List characteristics of Developmental and Epileptic Encephalopathies (DEEs).

Clinical characteristics of Developmental and Epileptic Encephalopathies (DEEs) include global developmental delay, contractures, refractory seizures, intractable seizures, epilepsy, facial dysmorphism, macrocephaly, cognitive deficits, autism, seizures, cerebellar dysgenesis, developmental delayed, behavioral abilities, developmental impairment or regression.